一名 30 歲男性，最近幾個月來他抱怨有反覆性的上腹部疼痛，特別是在晚上時更明顯。胃鏡檢查發現在十二指腸靠近幽門處，有一個 1 公分大小邊緣清楚的潰瘍性變化，其邊緣黏膜並未隆起。下列何者與該病人的病變的相關性最大？
A. Clostridium difficile
B. Entamoeba histolytica
C. Helicobacter pylori
D. Salmonella enteritidis

正確答案：C. Helicobacter pylori